Clinical trial exclusion criterion:
Poor venous access or inability to tolerate venipuncture.

Entity relations:
- AND("inability to tolerate venipuncture", "venipuncture")
- OR("Poor venous access", "inability to tolerate venipuncture")